Clinical trial exclusion criterion:
Any immunosuppressive disorder, such as HIV infection, common variable immunodeficiency, active cancers or chemotherapy.

Entity relations:
- Has_temporal("cancers", "active")
- Subsumes("immunosuppressive disorder", "HIV infection")
- OR("cancers", "chemotherapy")
- OR("HIV infection", "cancers", "common variable immunodeficiency")